Body mass index (BMI): 18 ≤ BMI ≤ 32 kg/m²

The above is a clinical trial inclusion criterion. Annotated with entity spans:
[Measurement: Body mass index (BMI)]: [Value: 18 ≤ BMI ≤ 32 kg/m²]